Clinical trial inclusion criterion:
Serum creatinine less than or equal to 2.0 mg/dL (Note: Patients with a serum creatinine greater than or equal to 1.4 and less than or equal to 2.0 mg/dL must demonstrate a 24-hour urinary creatinine clearance greater than or equal to 50 mL/min)

Entity relations:
- Has_value("Serum creatinine", "equal to 2.0 mg/dL")
- Has_value("serum creatinine", "greater than 1.4 mg/dL")
- Has_value("24-hour urinary creatinine clearance", "greater than 50 mL/min")
- Has_value("serum creatinine", "less than 2.0 mg/dL")
- OR("equal to 2.0 mg/dL", "2.0 mg/dL")
- OR("greater than 1.4 mg/dL", "equal to 1.4 mg/dL")
- OR("less than 2.0 mg/dL", "equal to 2.0 mg/dL")
- OR("greater than 50 mL/min", "equal to 50 mL/min")
- OR("Serum creatinine", "serum creatinine")
- OR("less than", "serum creatinine")